Clinical trial exclusion criterion:
Secondary knee osteoarthritis

Entity relations:
- Has_qualifier("knee osteoarthritis", "Secondary")